下列有關唾液腺的敘述何者錯誤？
A. 下頜下腺導管（submandibular duct）穿過下頜舌骨肌（mylohyoid m.），開口於舌繫帶基底兩旁
B. 頦下動脈（submental a.）供應下頜下腺
C. 鼓索神經（chorda tympani n.）傳遞舌下腺腺體分泌的副交感節前神經
D. 舌下腺的淋巴匯集到下頜下淋巴結（submandibular lymph nodes）

正確答案：A. 下頜下腺導管（submandibular duct）穿過下頜舌骨肌（mylohyoid m.），開口於舌繫帶基底兩旁